Clinical trial exclusion criterion:
contraindicate to ketamine

Annotated entities:
- Condition: "contraindicate"
- Drug: "ketamine"